¿Qué pueden indicar, entre otras cosas, las puntuaciones elevadas en la Escala F del Inventario Multifásico de Personalidad de Minnesota (MMPI)?:
1. Deseabilidad social e intento de buena imagen.
2. Un elevado número de respuestas incompletas.
3. El grado de sinceridad.
4. Que quien responde lo hace al azar o con excentricidad.
5. Inconsistencia de respuestas verdaderas.

Respuesta correcta: 4. Que quien responde lo hace al azar o con excentricidad.